In which motif of the RUNX1T1 protein is the rs34269950 SNP located?

The rs34269950 SNP of RUNX1T1 is located in the 'RRACH' motif.